23歲男性，口服某種藥物兩週後，引起毒性表皮溶解症（toxic epidermal necrolysis），下列何者藥物較無相關？
A. carbamazepine
B. allopurinol
C. acetaminophen
D. phenytoin

正確答案：C. acetaminophen